Clinical trial inclusion criterion:
Patients undergoing thoracic aorta surgery with hypothermic circulatory arrest, over 20-of age

Annotated entities:
- Qualifier: "thoracic aorta"
- Procedure: "surgery"
- Condition: "hypothermic circulatory arrest"
- Person: "age"
- Value: "over 20"